下列有關真菌中毒症的特徵，何者錯誤？
A. 真菌產生的毒素所引起
B. 發病有地區性
C. 發病有季節性
D. 具有傳染性

正確答案：D. 具有傳染性